Clinical trial exclusion criterion:
Patients with poorly controlled major psychiatric pathology.

Annotated entities:
- Condition: "psychiatric pathology"
- Qualifier: "major"
- Qualifier: "poorly controlled"